Clinical trial exclusion criterion:
Patients with history of glucose intolerance or diabetes.

Annotated entities:
- Condition: "glucose intolerance"
- Condition: "diabetes"
- Temporal: "history"